Eye disease treated with topical steroids.

The above is a clinical trial exclusion criterion. Annotated with entity spans:
[Condition: Eye disease] treated with [Procedure: topical steroids].